Clinical trial inclusion criteria:
Couple must have been in a new relationship that started no more than six months prior to study entry
Both partners plan on remaining in Montreal for at least 1 year
Plan on having continued sexual contact with partner
Be willing to comply with study procedures

Annotated entities:
- Observation: "new relationship"
- Temporal: "no more than six months prior to study entry"
- Observation: "remaining in Montreal"
- Multiplier: "for at least 1 year"
- Mood: "plan on"
- Mood: "Plan on"
- Observation: "having continued sexual contact with partner"
- Informed_consent: "Be willing to comply with study procedures"